Clinical trial inclusion criterion:
Haemoglobin ≥ 9g/dL.

Annotated entities:
- Measurement: "Haemoglobin"
- Value: "≥ 9g/dL"